Clinical trial exclusion criterion:
Has any progressive form of MS

Entity relations:
- Has_qualifier("MS", "progressive")